¿Qué grado de discapacidad mental corresponde a un cociente intelectual de treinta y seis?
1. Discapacidad mental límite.
2. Discapacidad mental leve.
3. Discapacidad mental moderada.
4. Discapacidad mental grave.
5. Discapacidad mental profunda.

Respuesta correcta: 3. Discapacidad mental moderada.